Clinical trial exclusion criterion:
Prior treatment with enzalutamide or abiraterone acetate for > 14 days prior to enrollment and completion of baseline tests.

Annotated entities:
- Drug: "enzalutamide"
- Drug: "abiraterone acetate"
- Multiplier: "for > 14 days"
- Temporal: "prior to enrollment"
- Reference_point: "enrollment"
- Procedure: "treatment"